Clinical trial exclusion criterion:
No consent

Entity relations:
- Has_negation("consent", "No")